除了啟動子（promoter）及多選殖位點（multiple cloning sites）外，下列何者是原核細胞表現載體（expression vector）的必要構造？
A. 促進子（enhancer）、操縱子（operator）
B. 致弱子（attenuator）、抑制子（repressor）
C. 促進子（enhancer）、核糖體結合區（ribosome binding site）
D. 核糖體結合區（ribosome binding site）、轉錄終止序列（transcriptional termination sequence）

正確答案：D. 核糖體結合區（ribosome binding site）、轉錄終止序列（transcriptional termination sequence）